臨床上下列何處之病變因超音波檢查不易檢測而最需使用磁振造影（MRI）檢查？
A. 脊上肌（supraspinatus）肌腱
B. 脊下肌（infraspinatus）肌腱
C. 三角肌下滑液囊（subdeltoid bursa）
D. 肩關節之盂唇（labrum）

正確答案：D. 肩關節之盂唇（labrum）